Clinical trial exclusion criterion:
other medical or psychiatric coexisting disorders that could increase the surgical risk or interfere with completion of the trial

Annotated entities:
- Post-eligibility: "other medical or psychiatric coexisting disorders that could increase the surgical risk or interfere with completion of the trial"